Clinical trial exclusion criterion:
Thyrotoxicosis

Annotated entities:
- Condition: "Thyrotoxicosis"